malignancy (except basal cell carcinoma) and/or chemotherapy within 1 year prior to screening; malignancy more than 1 year prior to screening must have been local and without metastasis and/or recurrence, and if treated with chemotherapy, without nervous system complications;

The above is a clinical trial exclusion criterion. Annotated with entity spans:
[Condition: malignancy] ([Negation: except] [Condition: basal cell carcinoma]) and/or [Procedure: chemotherapy] [Temporal: within 1 year prior to screening]; [Condition: malignancy] [Temporal: more than 1 year] prior to screening must have been [Qualifier: local] and [Negation: without] [Condition: metastasis] and/or [Condition: recurrence], and if treated with chemotherapy, without nervous system complications;